received adequate oral and written information about the study and signed an informed-consent form

The above is a clinical trial inclusion criterion. Annotated with entity spans:
[Informed_consent: received adequate oral and written information about the study and signed an informed-consent form]